Clinical trial exclusion criterion:
Women who are pregnant or nursing

Entity relations:
- OR("pregnant", "nursing")